Clinical trial exclusion criteria:
Age < 18 years
Creatinine > 1.5 mg/dL
History of severe allergy to Iodine contrast agents
Pregnancy
Active atrial fibrillation
Multiple premature ventricular or atrial contractions
Ejection fraction <35%
Class III congestive heart failure

Annotated entities:
- Person: "Age"
- Value: "< 18 years"
- Measurement: "Creatinine"
- Value: "> 1.5 mg/dL"
- Condition: "allergy"
- Procedure: "Iodine contrast agents"
- Condition: "Pregnancy"
- Condition: "atrial fibrillation"
- Condition: "Multiple premature ventricular contractions"
- Condition: "Multiple premature atrial contractions"
- Measurement: "Ejection fraction"
- Value: "<35%"
- Condition: "congestive heart failure"
- Qualifier: "Class III"